Clinical trial exclusion criterion:
clinically significant bleeding within the 30 days prior to the scheduled procedure;

Annotated entities:
- Qualifier: "clinically significant"
- Condition: "bleeding"
- Temporal: "within the 30 days prior to the scheduled procedure"
- Reference_point: "the scheduled procedure"